Clinical trial exclusion criterion:
Use of any of the following treatments or any other alternative therapy within 2 weeks of the pre-treatment PET scan that may have beneficial effects on mood, including St John's Wort, S-adenosyl methionine (SAMe), n-3 fatty acids, or light therapy.

Entity relations:
- Has_index("within 2 weeks of the pre-treatment PET scan", "pre-treatment PET scan")
- Has_temporal("treatments", "within 2 weeks of the pre-treatment PET scan")
- AND("treatments", "mood")
- Subsumes("S-adenosyl methionine", "SAMe")
- Subsumes("treatments", "St John's Wort")
- OR("treatments", "alternative therapy")
- OR("St John's Wort", "S-adenosyl methionine", "n-3 fatty acids", "light therapy")